下列何者對血小板功能的影響最小？
A. heparin
B. aspirin
C. uremia
D. von Willebrand disease

正確答案：A. heparin